Clinical trial inclusion criteria:
Non-ST segement elevation acute coronary syndrome

Annotated entities:
- Condition: "Non-ST segement elevation"
- Condition: "acute coronary syndrome"